No evidence of arterial disease (Arterial Duplex or Ankle Brachial Pressure Index >0.9)

The above is a clinical trial inclusion criterion. Annotated with entity spans:
[Negation: No] evidence of [Condition: arterial disease] ([Procedure: Arterial Duplex] or [Measurement: Ankle Brachial Pressure Index] [Value: >0.9])